Clinical trial inclusion criterion:
Body mass index (BMI) from 18 to 35kg/m2

Entity relations:
- Subsumes("Body mass index", "BMI")
- Has_value("Body mass index", "from 18 to 35kg/m2")